Infection with hepatitis B virus (HBV) or human immunodeficiency virus (HIV)

The above is a clinical trial exclusion criterion. Annotated with entity spans:
Infection with [Condition: hepatitis B virus (HBV)] or [Condition: human immunodeficiency virus (HIV)]